先天性甲狀腺低能症（congenital hypothyroidism）最常見的原因為：
A. 甲狀腺發育不全（aplasia）
B. 甲狀腺異位（ectopia）
C. 甲狀腺過氧化酶缺損（thyroid peroxidase defect）
D. 甲狀腺促素缺乏（TSH deficiency）

正確答案：B. 甲狀腺異位（ectopia）